History of other disease, metabolic dysfunction, physical examination finding, or clinical laboratory finding giving reasonable suspicion of a disease or condition that contraindicates use of an investigational drug or that might affect interpretation of the results of the study or render the patient at high risk for treatment complications

The above is a clinical trial exclusion criterion. Annotated with entity spans:
[Temporal: History] of [Qualifier: other] [Condition: disease], [Condition: metabolic dysfunction], [Condition: physical examination finding], or [Condition: clinical laboratory finding] giving reasonable [Mood: suspicion of] a [Condition: disease] or [Condition: condition] that [Condition: contraindicates] use of an [Drug: investigational drug] or that might [Observation: affect interpretation of the results] of the study or [Observation: render the patient at high risk] for [Condition: treatment complications]